Cardiogenic shock;

The above is a clinical trial exclusion criterion. Annotated with entity spans:
[Condition: Cardiogenic shock];